Clinical trial exclusion criterion:
Contraindications to general anesthesia

Annotated entities:
- Condition: "Contraindications to general anesthesia"
- Procedure: "general anesthesia"